Clinical trial exclusion criterion:
Allergies to study drugs.

Entity relations:
- AND("Allergies", "study drugs")